What does a PET (Positron Excitation Tomography) measure?

Positron Excitation Tomography (PET) is a method that uses photoreactive nucleotides (Percutaneous Transluminal Angioplasty) to detect structural changes in the central nervous system (CNS) following ischemic injury.